Clinical trial inclusion criterion:
Angiographically confirmed acute massive pulmonary embolism with involvement of Central pulmonary arteries.

Annotated entities:
- Procedure: "Angiographically"
- Qualifier: "Angiographically confirmed"
- Qualifier: "acute"
- Qualifier: "massive"
- Condition: "pulmonary embolism"
- Condition: "involvement of Central pulmonary arteries"